下列有關全民健保總額支付制度之敘述，何者最不正確？
A. 醫療大餅仍持續增加
B. 所有醫院會互推病人
C. 有分局總額預算
D. 可提高專業自主性

正確答案：B. 所有醫院會互推病人